Active or recent history (= 1 year) of drug or alcohol abuse

The above is a clinical trial exclusion criterion. Annotated with entity spans:
Active or recent history ([Temporal: = 1 year]) of [Observation: drug] or [Observation: alcohol abuse]